Clinical trial exclusion criterion:
A history of life-threatening asthma defined for this protocol as an asthma episode that required intubation, hypercapnea requiring non-invasive ventilatory support, respiratory arrest, hypoxic seizures or asthma-related syncopal episode(s).

Entity relations:
- Has_qualifier("asthma", "life-threatening")
- AND("asthma episode", "intubation")
- Subsumes("life-threatening", "asthma episode")
- Has_temporal("asthma", "history")
- Subsumes("life-threatening", "non-invasive ventilatory support")
- OR("asthma episode", "hypoxic seizures", "asthma-related syncopal episode", "respiratory arrest", "hypercapnea")